What the chromsomal location of the gene that is deleted in Potocki-Shaffer syndrome?

In Potocki-Shaffer syndrome (PSS), the full phenotypic spectrum is manifested when deletions are at least 2.1 Mb in size at 11p11.2